What is the Her2 status in Li-Fraumeni syndrome?

In the background of a germline TP53 mutation of the Li-Fraumeni syndrome, the Her2 status was found to be positive in 63-83% of the cases.